Clinical trial exclusion criterion:
Ocular surgical procedures 3 months before the protocol inclusion

Annotated entities:
- Procedure: "Ocular surgical procedures"
- Temporal: "3 months before the protocol inclusion"
- Reference_point: "protocol inclusion"
- Temporal: "3 months before the protocol inclusion"